Heart failure stage D as defined by American Heart Association (7).

The above is a clinical trial exclusion criterion. Annotated with entity spans:
[Condition: Heart failure] [Measurement: stage] [Value: D] as defined by [Qualifier: American Heart Association] (7).